Clinical trial inclusion criterion:
Patients must have a pre-treatment granulocyte count (i.e., segmented neutrophils + bands) of greater than or equal to 1,500/mm3, a hemoglobin level of greater than or equal to 9 gm/dl, and platelet count greater than or equal to 50,000/mm3. The granulocyte requirement may be waived if in the investigator's opinion the lower count reflects hypersplenism with adequate bone marrow reserves.

Annotated entities:
- Measurement: "granulocyte count"
- Temporal: "pre-treatment"
- Measurement: "segmented neutrophils + bands"
- Value: "greater than or equal to 1,500/mm3"
- Measurement: "hemoglobin level"
- Value: "greater than or equal to 9 gm/dl"
- Measurement: "platelet count"
- Value: "greater than or equal to 50,000/mm3"